38歲男性，三星期前開始出現倦怠，頭痛，間歇性微燒，最近兩天頭痛加劇合併噁心，嘔吐與嗜睡。身體檢查發現頸部僵硬。腦脊髓液檢查呈現：壓力為240 mmH2O，白血球為480顆（其中淋巴球占80%），蛋白質為80 mg/dL，糖值為20 mg/dL（血糖值為120 mg/dL），隱球菌抗原（cryptococcal antigen）為陰性。血清之性病研究實	室凝集法（VDRL）為陰性。下列何者為最有可能之診斷？
A. 病毒性腦膜炎
B. 結核性腦膜炎
C. 未經抗生素治療過之細菌性腦膜炎
D. 寄生蟲性腦膜炎

正確答案：B. 結核性腦膜炎